Clinical trial inclusion criterion:
Subject must be at least 30 years of age.

Annotated entities:
- Person: "age"
- Value: "at least 30 years"